Which protein is the main marker of Cajal bodies?

coilin